下列何種細胞分布在表皮的基底層（stratum basale），會與神經末梢連結，且為機械性受器（mechanoreceptor）？
A. 棘細胞（prickle cells）
B. 黑色素細胞（melanocyte）
C. 蘭氏細胞（Langerhans' cells）
D. 默氏細胞（Merkel's cells）

正確答案：D. 默氏細胞（Merkel's cells）